CMV-positive GBM

The above is a clinical trial inclusion criterion. Annotated with entity spans:
[Qualifier: CMV-positive] [Condition: GBM]